Clinical trial inclusion criteria:
LVAD on warfarin requiring temporary interruption of anticoagulation for procedures

Annotated entities:
- Condition: "LVAD"
- Drug: "warfarin"
- Non-representable: "requiring temporary interruption of anticoagulation for procedures"
- Qualifier: "requiring temporary interruption of anticoagulation for procedures"